Clinical trial inclusion criterion:
routinely referred for small bowel video capsule endoscopy (CE)

Annotated entities:
- Multiplier: "routinely referred"
- Procedure: "small bowel video capsule endoscopy"